Clinical trial inclusion criterion:
Written informed consent from participating subject

Annotated entities:
- Informed_consent: "Written informed consent from participating subject"